Clinical trial exclusion criterion:
Positive for hepatitis B, hepatitis C or HIV infection

Annotated entities:
- Measurement: "hepatitis B"
- Value: "Positive"
- Measurement: "hepatitis C"
- Condition: "HIV infection"